Clinical trial inclusion criterion:
Supracondylar fracture

Annotated entities:
- Condition: "Supracondylar fracture"